65 歲長期糖尿病女性病患，由肝膽腸胃科會診，主訴左眼視力模糊已有三天之久。病患因發燒、頭痛、全身倦怠來院就診，內科發現肝臟有一個 3.5 cm 大的膿瘍，經抽取後發現為 Gram(-)桿菌性肝膿瘍，眼科檢查發現病人視力右眼 0.4 左眼僅辨手動，左眼前房有小量蓄膿（hypopyon），瞳孔周圍有白色膿狀滲出物，眼底鏡檢查發現左眼玻璃體內充滿白色混濁物，眼底不可見，右眼眼底視網膜鼻 側下方有一個黃白色視網膜下（subretinal）隆起物。關於該病患眼病的敘述，下列何者錯誤？
A. 病患很可能患有內因性眼內炎（endogenous endophthalmitis）
B. 病患的致病原很可能為克雷白氏桿菌（Klebsiella pneumoniae）
C. 此疾患臺灣人較西方人的發生率低
D. 病患的眼疾預後非常不好

正確答案：C. 此疾患臺灣人較西方人的發生率低